Current viral or bacterial infection.

The above is a clinical trial exclusion criterion. Annotated with entity spans:
[Temporal: Current] viral or [Condition: bacterial infection].